不停跳冠狀動脈繞道手術進行中，經由肺動脈導管監測，觀察到肺動脈壓突然升高，但血壓仍維持在正常範圍內，下列有關麻醉醫師做的處理，何者錯誤？
A. 加深麻醉深度
B. 增加呼吸速率
C. 增加潮氣容積（tidal volume）
D. 給予 phosphodiesterase III 抑制劑

正確答案：C. 增加潮氣容積（tidal volume）